2. Patients with PHN must have had pain >3 months after rash healing

The above is a clinical trial inclusion criterion. Annotated with entity spans:
2. Patients with [Condition: PHN] must have had [Condition: pain] [Multiplier: >3 months] [Temporal: after rash healing]